Pregnant or lactating female.

The above is a clinical trial exclusion criterion. Annotated with entity spans:
[Condition: Pregnant] or [Observation: lactating] [Person: female].